Clinical trial exclusion criterion:
Patients who live without a home telephone

Annotated entities:
- Non-representable: "Patients who live without a home telephone"